Clinical trial exclusion criterion:
4. Anticonvulsants: carbamazepine, phenytoin, phenobarbital

Annotated entities:
- Parsing_Error: "4."
- Drug: "carbamazepine"
- Drug: "phenytoin"
- Drug: "phenobarbital"